Confirmed allergy to apatinin and or its excipients;

The above is a clinical trial exclusion criterion. Annotated with entity spans:
Confirmed [Condition: allergy] to [Drug: apatinin] and or its [Drug: excipients];